Which disease is caused by de novo VPS4A mutations?

De novo mutations in the gene encoding for endosomal sorting enzyme VPS4A (Val4A) cause multisystem disease